cardiorespiratory arrest,

The above is a clinical trial exclusion criterion. Annotated with entity spans:
[Condition: cardiorespiratory arrest],